Clinical trial inclusion criterion:
No known allergy to Bupivacaine.

Entity relations:
- AND("allergy", "Bupivacaine")
- Has_negation("allergy", "No")